Clinical trial inclusion criterion:
Patients with posterior or posterolateral disc herniations at one level between L1 and S1 with radiographic confirmation of neural compression using CT and/or MRI.

Annotated entities:
- Qualifier: "posterolateral"
- Qualifier: "posterior"
- Condition: "disc herniations"
- Qualifier: "one level between L1 and S1"
- Procedure: "radiographic"
- Qualifier: "radiographic confirmation"
- Condition: "neural compression"
- Procedure: "CT"
- Procedure: "MRI"